Clinical trial exclusion criterion:
A positive drug screen for illicit drugs

Entity relations:
- Has_value("drug screen for illicit drugs", "positive")